Clinical trial exclusion criterion:
History of alcohol or drug dependence or abuse in the last three years

Annotated entities:
- Condition: "drug dependence"
- Condition: "alcohol dependence"
- Condition: "drug abuse"
- Condition: "alcohol abuse"
- Temporal: "in the last three years"